Clinical trial inclusion criterion:
Men or women, 18 to 65 years old with a BMI of 35 kg/m2 or greater who will be undergoing bariatric surgery (VSG and RYGB)

Entity relations:
- Has_value("old", "18 to 65 years")
- Has_value("BMI", "35 kg/m2 or greater")
- AND("bariatric surgery", "VSG")
- AND("bariatric surgery", "RYGB")
- OR("Men", "women")